Clinical trial exclusion criterion:
12. Patients with active connective tissue disease

Entity relations:
- Has_temporal("connective tissue disease", "active")